Body mass index more than 35

The above is a clinical trial exclusion criterion. Annotated with entity spans:
[Measurement: Body mass index] [Value: more than 35]